對慢性鼻竇炎患者實施鼻竇內視鏡手術時，在處理下列那一個鼻竇時，比較會傷及視神經（optic nerve）及內頸動脈（internal carotid artery）？
A. 上頜竇（maxillary sinus）
B. 額竇（frontal sinus）
C. 前篩竇（anterior ethmoidal sinus）
D. 蝶竇（sphenoid sinus）

正確答案：D. 蝶竇（sphenoid sinus）